Clinical trial inclusion criteria:
Participants must have completed 3 cycles of a bortezomib-based induction regimen (as defined by current NCCN guidelines) and have no evidence of disease progression as defined by IMWG criteria.
Participants with light chain and free light chain (FLC) only may be enrolled if they meet all the criteria for a diagnosis of MM.
Participants must be considered by their physician eligible to receiving the IRD regimen.
Eastern Cooperative Oncology Group (ECOG) performance status and/or other performance status 0, 1, or 2 at time of enrollment.

Annotated entities:
- Multiplier: "3 cycles"
- Drug: "bortezomib"
- Procedure: "induction regimen"
- Qualifier: "NCCN guidelines"
- Value: "no evidence of disease progression"
- Measurement: "IMWG criteria"
- Measurement: "criteria for a diagnosis of MM"
- Value: "all"
- Condition: "light chain and free light chain (FLC)"
- Mood: "eligible to"
- Procedure: "IRD regimen"
- Measurement: "Eastern Cooperative Oncology Group (ECOG) performance status"
- Value: "0, 1, or 2"
- Temporal: "at time of enrollment"